Clinical trial inclusion criteria:
Informed consent
Diagnosis of type 2 diabetes (HbA1c > 48 mmol/mol)
Age older than 30 years

Annotated entities:
- Informed_consent: "Informed consent"
- Condition: "type 2 diabetes"
- Measurement: "HbA1c"
- Value: "> 48 mmol/mol"
- Person: "Age"
- Value: "older than 30 years"